Clinical trial exclusion criterion:
Systemic or inhaled corticosteroids.

Entity relations:
- Has_qualifier("Systemic corticosteroids", "Systemic")
- Has_qualifier("inhaled corticosteroids", "inhaled")